Clinical trial exclusion criterion:
Patients with recent cerebral hemorrhage.

Entity relations:
- Has_temporal("cerebral hemorrhage", "recent")